Clinical trial exclusion criterion:
Known hypersensitivity to study drug (ferric carboxymaltose or equivalent) or its excipients

Annotated entities:
- Condition: "hypersensitivity"
- Drug: "study drug"
- Drug: "ferric carboxymaltose"